Clinical trial exclusion criterion:
Subject has participated in any study using an investigational drug or device within 30 days or within 5 half-lives of the investigational drug (whichever is longer) of entry into this study.

Annotated entities:
- Observation: "participated in any study"
- Drug: "investigational drug"
- Device: "device"
- Temporal: "of the investigational drug within 30 days"
- Temporal: "within 5 half-lives of the investigational drug"
- Reference_point: "of the investigational drug"